Clinical trial inclusion criterion:
Hoehn and Yahr stage = 3

Annotated entities:
- Measurement: "Hoehn and Yahr"
- Value: "stage = 3"